Clinical trial inclusion criterion:
Hepatitis B virus DNA <100 IU/mL.

Entity relations:
- Has_value("Hepatitis B virus DNA", "<100 IU/mL")